Clinical trial inclusion criterion:
Subjects aged 18 years or older, at the time of signing the informed consent.

Annotated entities:
- Person: "aged"
- Value: "18 years or older"
- Temporal: "at the time of signing the informed consent"
- Reference_point: "signing the informed consent"